58歲女性病患，跌倒後導致右側遠端橈骨骨折（distal radius fracture），在急診室接受閉鎖式復位（closed reduction）後，以X光檢查復位情形。下列何者不是遠端橈骨骨折復位後可接受的放射參數（radiographic parameters）？
A. 患側的橈長（radial length）和健側相比，其差異在2mm以內
B. 患側的關節內降差（intra-articular step-off）小於2mm
C. 患側的背傾（dorsal tilt）角度為15度
D. 患側的橈角（radial angle）和健側相比，其差異在5度以內

正確答案：C. 患側的背傾（dorsal tilt）角度為15度